Clinical trial inclusion criterion:
suspicion of nonfunctional P-NET on primary CT (i.e hypervascularity) or MRI

Annotated entities:
- Condition: "nonfunctional P-NET"
- Mood: "suspicion"
- Procedure: "primary CT"
- Condition: "hypervascularity"
- Procedure: "MRI"